Clinical trial inclusion criterion:
8. Negative pregnancy test (if female of childbearing potential)

Annotated entities:
- Parsing_Error: "8."
- Measurement: "pregnancy test"
- Value: "Negative"
- Condition: "childbearing potential"
- Person: "female"